鈍性腹部外傷時，最常發生損傷的器官為：
A. 肝臟
B. 脾臟
C. 胰臟
D. 腎臟

正確答案：B. 脾臟